尿酸結晶沉澱在腎小管（renal tubules）及集尿管（collecting ducts）引起尿流阻塞稱為：
A. 痛風
B. 腎結石
C. 尿酸鹽腎病變（urate nephropathy）
D. 尿酸腎病變（uric acid nephropathy）

正確答案：D. 尿酸腎病變（uric acid nephropathy）